1. Justification: The population of interest here is a healthy control population with no substance use disorder. Current use of illicit substances could impact on seizure threshold and is therefore contra-indicated for TMS.

The above is a clinical trial exclusion criterion. Annotated with entity spans:
[Parsing_Error: 1.] [Not_a_criteria: Justification: The population of interest here is a healthy control population with no substance use disorder.] [Parsing_Error: Current use of illicit substances could impact on seizure threshold and is therefore contra-indicated for TMS.]